La dermatitis por contacto está mediada por:
1. IgE.
2. IgG.
3. Eosinófilos activados.
4. Linfocitos NK activados.
5. Linfocitos Th1 activados.

Respuesta correcta: 5. Linfocitos Th1 activados.